Clinical trial exclusion criterion:
Use of pharmacotherapy in the month prior to enrollment, including prior use of varenicline

Annotated entities:
- Procedure: "pharmacotherapy"
- Temporal: "month prior to enrollment"
- Reference_point: "enrollment"